¿Con cuál de los siguientes parámetros se identifica el concepto de fragilidad en las personas mayores?
1. Menor reserva fisiológica.
2. Dependencia.
3. Edad avanzada.
4. Polifarmacia.
5. Incapacidad.

Respuesta correcta: 1. Menor reserva fisiológica.